Clinical trial exclusion criterion:
Brain, spinal, ophthalmologic, or major surgery or trauma within the past 90 days other than the elective knee/hip surgery

Annotated entities:
- Procedure: "surgery"
- Condition: "trauma"
- Qualifier: "major"
- Qualifier: "ophthalmologic"
- Qualifier: "spinal"
- Qualifier: "Brain"
- Temporal: "within the past 90 days"
- Procedure: "elective knee surgery"
- Procedure: "elective hip surgery"
- Negation: "other than"